下列那些是美國麻醉醫學會於1994年所公佈之對手術室外麻醉的臨床指引（Guidelines for non-operating room  anesthetizing locations）？①足夠的麻醉照護空間 ②可靠的氧氣供應設備 ③適合的生理監測儀器 ④勿需準備電擊器（defibrillator）
A. 僅①②③
B. ①②③④
C. 僅①④
D. 僅②③④

正確答案：A. 僅①②③